Clinical trial exclusion criterion:
Patients with clinically significant cardiovascular, renal, hepatic, endocrine disease, cancer or diabetes

Entity relations:
- Has_qualifier("cardiovascular disease", "significant")
- OR("cardiovascular disease", "renal disease", "hepatic disease", "endocrine disease", "cancer", "diabetes")